What is a J pouch?

Formation of a colonic J-pouch with anastomosis to the rectal stump is an accepted form of reconstruction after low anterior resection (LAR) for rectal carcinoma total proctocolectomy with outcomes after ileal J-pouch anal anastomosis (IPAA) at a single institution